下列有關幽門螺旋桿菌之敘述，何者正確？
A. 由於urease test之診斷率過低，因此需以細菌培養來確立診斷
B. 無潰瘍之消化不良患者，若罹有此菌，國際共識認為需要殺菌
C. 將幽門螺旋桿菌殺菌清除後，一定會增加胃食道逆流疾病之機會
D. 胃潰瘍患者之幽門螺旋桿菌之罹患率低於十二指腸潰瘍患者

正確答案：D. 胃潰瘍患者之幽門螺旋桿菌之罹患率低於十二指腸潰瘍患者